Which drugs are included in the Lonsurf pill?

Lunsurf pill includes trifluridine and tipiracil. It is a novel form of chemotherapy for metastatic colorectal cancer.